Clinical trial exclusion criterion:
Previously randomized and dosed in this study. This criterion does not apply to heterozygous subjects.

Annotated entities:
- Not_a_criteria: "Previously randomized and dosed in this study."
- Parsing_Error: "This criterion does not apply to heterozygous subjects."